Clinical trial exclusion criterion:
7. Ankle brachial pressure index <0.65

Annotated entities:
- Parsing_Error: "7."
- Measurement: "Ankle brachial pressure index"
- Value: "<0.65"